Epilepsy;

The above is a clinical trial exclusion criterion. Annotated with entity spans:
[Condition: Epilepsy];